Clinical trial inclusion criterion:
age 18 years or older

Entity relations:
- Has_value("age", "18 years or older")